Clinical trial inclusion criterion:
COPD diagnosed according to GOLD, FEV1 40-80% predicted, SpO2 =92% at 750 m.

Entity relations:
- Has_value("FEV1", "40-80% predicted")
- Has_value("SpO2", "=92% at 750 m")
- AND("GOLD", "FEV1")
- AND("GOLD", "COPD")
- AND("GOLD", "SpO2")